¿Qué hormona provoca la ovulación?:
1. La FSH.
2. La LH.
3. Los estrógenos.
4. La progesterona.
5. La protaglandinas.

Respuesta correcta: 2. La LH.